有關真核生物基因啟動子（promoter）之特性，下列敘述何者錯誤？
A. 有些啟動子在開始轉錄位置附近含有 initiator element
B. 有些啟動子含 GC box
C. 有些啟動子含 Pribnow box
D. 有些啟動子含 TATA box

正確答案：C. 有些啟動子含 Pribnow box